Clinical trial exclusion criterion:
known thromboembolic disease or with high risk of thromboembolism, warranting extra anticoagulation in connection with the procedure

Entity relations:
- Has_mood("thromboembolism", "high risk of")
- AND("thromboembolism", "extra anticoagulation")
- OR("thromboembolic disease", "thromboembolism")